Any anti-coagulation therapy (apart from rivaroxaban for second objective)

The above is a clinical trial exclusion criterion. Annotated with entity spans:
Any [Procedure: anti-coagulation therapy] ([Negation: apart from] [Drug: rivaroxaban] for second objective)